T-score according to DXA: <-2.5

The above is a clinical trial inclusion criterion. Annotated with entity spans:
[Measurement: T-score] [Qualifier: according to DXA]: [Value: <-2.5]